Clinical trial inclusion criterion:
1. Neoadjuvant treatment prior to radiation therapy or radical prostatectomy, provided that the total duration of exposure does not exceed 10 months.

Annotated entities:
- Procedure: "Neoadjuvant treatment"
- Temporal: "prior to radiation therapy or radical prostatectomy"
- Procedure: "radiation therapy"
- Procedure: "radical prostatectomy"
- Reference_point: "radiation therapy or radical prostatectomy"
- Measurement: "total duration of exposure"
- Value: "does not exceed 10 months"